下列何者為二項類別變項（binomial variable）？
A. 血中鉛的濃度
B. 每週運動的次數
C. 體重
D. 性別

正確答案：D. 性別